Clinical trial exclusion criterion:
Subjects who are incarcerated or wards of the state

Annotated entities:
- Non-representable: "Subjects who are incarcerated or wards of the state"